Clinical trial inclusion criteria:
Willing and capable of providing informed consent
Has an indication for implantation of a single or dual chamber ICD or CRT-D system in their respective geography
Subjects planned to be implanted with the RELIANCE 4-FRONT Passive Fixation Lead
Willing and capable of participating in all testing/ visits associated with this clinical study at an approved clinical study center and at the intervals defined by this protocol
Age 18 or above, or of legal age to give informed consent specific to state and national law

Annotated entities:
- Post-eligibility: "Willing and capable of providing informed consent"
- Observation: "indication"
- Procedure: "chamber ICD implantation of a single"
- Procedure: "dual chamber ICD implantation of a"
- Procedure: "CRT-D system implantation of a"
- Mood: "planned"
- Procedure: "implanted with the RELIANCE 4-FRONT Passive Fixation Lead"
- Device: "RELIANCE 4-FRONT Passive Fixation Lead"
- Non-query-able: "Willing and capable of participating in all testing/ visits associated with this clinical study at an approved clinical study center and at the intervals defined by this protocol"
- Person: "Age"
- Value: "18 or above"
- Value: "of legal age"